Clinical trial exclusion criteria:
Hemoglobin concentration under 6.5 mmol/l screening
HBA1c more than 108 mmol/l
Non-compliant with blood-letting
Clinically infected ulcer
Patient planned for or has had a revascularization procedure in the affected leg within the last 8 weeks
The ulcer have been treated with growth factors in the last 8 weeks
History of deep venous insufficiency, chronic venous leg ulcer or stasis dermatitis
Breast-feeding women or fertile women not agreeing to use an effective method of contraception
Participation in another clinical ulcer-healing study within the last 4 weeks
Patient has previously been randomized in this study
Judgement by the investigator that the patient is not able to participate in the study

Annotated entities:
- Measurement: "Hemoglobin concentration"
- Value: "under 6.5 mmol/l"
- Measurement: "HBA1c"
- Value: "more than 108 mmol/l"
- Condition: "Non-compliant"
- Procedure: "blood-letting"
- Non-query-able: "Non-compliant"
- Condition: "infected ulcer"
- Procedure: "revascularization procedure"
- Reference_point: "affected leg"
- Temporal: "within the last 8 weeks"
- Mood: "planned"
- Observation: "has had"
- Condition: "ulcer"
- Procedure: "treated"
- Drug: "growth factors"
- Temporal: "in the last 8 weeks"
- Condition: "deep venous insufficiency"
- Condition: "chronic venous leg ulcer"
- Condition: "stasis dermatitis"
- Temporal: "History"
- Condition: "Breast-feeding"
- Person: "women"
- Condition: "fertile"
- Person: "women"
- Observation: "agreeing to use an effective method of contraception"
- Negation: "not"
- Non-query-able: "Participation in another clinical ulcer-healing study within the last 4 weeks"
- Non-query-able: "Patient has previously been randomized in this study"
- Subjective_judgement: "Judgement by the investigator that the patient is not able to participate in the study"
- Non-query-able: "Judgement by the investigator that the patient is not able to participate in the study"